Clinical trial exclusion criterion:
Congestive heart failure or coronary artery disease

Annotated entities:
- Condition: "Congestive heart failure"
- Condition: "coronary artery disease"